Clinical trial exclusion criterion:
the child has experienced a severe allergic reaction after previous vaccination, drug or food.

Annotated entities:
- Person: "child"
- Condition: "severe allergic reaction"
- Temporal: "after previous vaccination, drug or food"
- Reference_point: "previous vaccination, drug or food"
- Procedure: "vaccination"
- Procedure: "drug"
- Procedure: "food"
- Temporal: "previous"